Clinical trial exclusion criterion:
Rest pain or tissue loss due to PAD (Fontaine stage III and IV),

Annotated entities:
- Condition: "Rest pain"
- Condition: "tissue loss"
- Condition: "PAD"
- Measurement: "Fontaine stage"
- Value: "III"
- Value: "IV"